Clinical trial exclusion criterion:
Presence or history of dysphagia or conditions predisposing to dysphagia (eg, uncontrolled gastroesophageal reflux disease [GERD], dyspepsia, etc)

Entity relations:
- Has_qualifier("gastroesophageal reflux disease", "uncontrolled")
- Subsumes("gastroesophageal reflux disease", "GERD")
- Subsumes("dysphagia", "gastroesophageal reflux disease")
- Has_temporal("dysphagia", "history of")
- OR("gastroesophageal reflux disease", "dyspepsia")
- OR("dysphagia", "conditions predisposing to dysphagia")